下列何者不是酒精戒斷（alcohol withdrawal）常見之症狀？
A. tremor
B. auditory hallucination
C. seizure
D. agitation

正確答案：B. auditory hallucination